Clinical trial exclusion criterion:
Any cases converted to abdominal hysterectomy or other additional elective surgical procedures performed at time of abdominal myomectomy will be excluded from data analysis

Entity relations:
- Has_mood("abdominal hysterectomy", "converted to")
- Has_index("at time of abdominal myomectomy", "abdominal myomectomy")
- multi("abdominal myomectomy", "abdominal myomectomy")
- Has_qualifier("surgical procedures", "elective")
- Has_temporal("surgical procedures", "at time of abdominal myomectomy")
- Has_qualifier("surgical procedures", "additional")
- Has_qualifier("surgical procedures", "other")
- OR("abdominal hysterectomy", "surgical procedures")